有關 Legionella pneumophila 引起的肺炎，下列描述何者錯誤？
A. 是一種 atypical pneumonia，與水塔或水質污染有關
B. 常好發於抽菸、慢性肺部疾病以及年輕人
C. 臨床症狀除了發燒、咳嗽，常合併其他的肺外症狀
D. 較其它病菌所引起的肺炎，更常有低血鈉症

正確答案：B. 常好發於抽菸、慢性肺部疾病以及年輕人